Clinical trial inclusion criterion:
Adequate heart function

Annotated entities:
- Condition: "Adequate heart function"
- Measurement: "heart function"
- Value: "Adequate"